Allergies to shell fish, seafood, eggs or iodine

The above is a clinical trial exclusion criterion. Annotated with entity spans:
[Condition: Allergies] to [Observation: shell fish], [Observation: seafood], [Observation: eggs] or [Drug: iodine]